Clinical trial inclusion criteria:
18 years or older patients who are proven to be infected by Helicobacter pylori based on positive in Urea Breath Test or positive in histopathologic examination of biopsy in antrum and corpus of gaster through esophagoduodenoscopy.

Annotated entities:
- Value: "18 years or older"
- Condition: "infected by Helicobacter pylori"
- Value: "positive"
- Measurement: "Urea Breath Test"
- Value: "positive"
- Procedure: "histopathologic examination of biopsy"
- Qualifier: "antrum of gaster"
- Qualifier: "corpus of gaster"
- Procedure: "esophagoduodenoscopy"
- Person: "old"